Sobre la metilación del DNA es cierto que:
1. Inhibe la transcripción.
2. Puede ser mono- di- o trimetilación.
3. La introducen enzimas denominadas HAT.
4. La eliminan enzimas denominadas HDACs.

Respuesta correcta: 1. Inhibe la transcripción.